Clinical trial exclusion criterion:
Uncontrolled intercurrent illness, including but not limited to ongoing or active infection requiring parenteral antibiotics at enrollment

Annotated entities:
- Qualifier: "Uncontrolled"
- Condition: "intercurrent illness"
- Temporal: "ongoing"
- Qualifier: "active"
- Condition: "infection"
- Drug: "parenteral antibiotics"
- Temporal: "at enrollment"
- Reference_point: "enrollment"